Operative findings not suggestive of endometriotic cyst

The above is a clinical trial exclusion criterion. Annotated with entity spans:
[Condition: Operative findings] [Negation: not] [Mood: suggestive] of [Condition: endometriotic cyst]